Is pregnant or breast feeding or expecting to conceive or father starting from the first dose of study medication, throughout the study period, and for up to 120 days after the last dose of study medication

The above is a clinical trial exclusion criterion. Annotated with entity spans:
Is [Condition: pregnant] or [Observation: breast feeding] or [Observation: expecting to conceive] or father [Temporal: starting from the first dose of study medication], [Temporal: throughout the study period], and [Temporal: for up to 120 days after the last dose of study medication]